下列何者是給予腸道外營養（parenteral feeding）的適應性？
A. 甲狀腺機能亢進（hyperthyroidism）
B. 急性膽囊炎（acute cholecystitis）
C. 胃腸道皮膚瘻管（gastrointestinal-cutaneous fistulas）
D. 靜脈血栓栓塞（venous thromboembolism）

正確答案：C. 胃腸道皮膚瘻管（gastrointestinal-cutaneous fistulas）